Past medical history of dysphagia or aspiration pneumonia

The above is a clinical trial exclusion criterion. Annotated with entity spans:
[Temporal: Past medical history] of [Condition: dysphagia] or [Condition: aspiration pneumonia]